history of gastro-intestinal inflammatory diseases

The above is a clinical trial exclusion criterion. Annotated with entity spans:
history of [Condition: gastro-intestinal inflammatory diseases]